一位 75 歲男性 COPD 病人，意識清楚，因咳嗽加劇，黃痰增多，發燒且有呼吸困難和喘鳴聲掛急診，急診檢查顯示 WBC：15,000/μL，neutrophil/lymphocyte：90/8%；動脈血（room air）檢查 mmHg，PaCO2=60 mmHg，HCO3-=30 mEq/L，pH=7.22；vital signs：BP 160/100 mmHg， heart rate 120/min（regular），respiratory rate 30/min，體溫：38°C；下列處置何者最適宜？
A. 給予吸入性擴張劑（bronchodilators）、抗生素和口服類固醇
B. 給予吸入性擴張劑（bronchodilators）、抗生素、口服類固醇和氧氣
C. 給予吸入性擴張劑（bronchodilators）、抗生素、口服類固醇、氧氣，並給予非侵襲性正壓呼吸
D. 給予吸入性擴張劑（bronchodilators）、抗生素、口服類固醇、氧氣和鎮靜劑，立即插氣管內管和使用侵襲性呼吸器（invasive mechanical ventilator）輔助呼吸

正確答案：C. 給予吸入性擴張劑（bronchodilators）、抗生素、口服類固醇、氧氣，並給予非侵襲性正壓呼吸